Clinical trial inclusion criterion:
ASA I-III

Entity relations:
- Has_value("ASA", "I-III")